Clinical trial inclusion criterion:
Platelet count greater than or equal to 100 x 10^9/L

Entity relations:
- Has_value("Platelet count", "greater than 100 x 10^9/L")
- OR("greater than 100 x 10^9/L", "equal to 100 x 10^9/L")